Clinical trial inclusion criterion:
Serum creatinine of < 1.5 ULN or calculated CrCl of > 50 mL/min

Entity relations:
- Has_value("Serum creatinine", "< 1.5 ULN")
- Has_value("calculated CrCl", "> 50 mL/min")
- OR("Serum creatinine", "calculated CrCl")